Clinical trial inclusion criterion:
Participants having H. pylori related chronic gastritis with/without peptic ulcers who are aged greater than 20 years old and are willing to received eradication therapy.

Entity relations:
- Has_qualifier("chronic gastritis", "H. pylori related")
- Has_value("aged", "greater than 20 years old")
- Has_mood("eradication therapy", "willing to receive")